Surgery with major complication, or need blood transfusion.

The above is a clinical trial exclusion criterion. Annotated with entity spans:
[Procedure: Surgery] with [Condition: major complication], or [Mood: need] [Condition: blood transfusion].